Clinical trial exclusion criteria:
endometrial hyperplasia with atypia,
estrogen-progestin therapy in the 2 months before enrollment,
autoimmune diseases,
chronic, metabolic, systemic and endocrine disorders, including hyperandrogenism, hyperprolactinemia, diabetes mellitus and thyroid disease,
hypogonadotropic hypogonadism,
majors clinical conditions

Annotated entities:
- Condition: "endometrial hyperplasia"
- Condition: "atypia"
- Procedure: "estrogen-progestin therapy"
- Temporal: "in the 2 months before enrollment"
- Condition: "autoimmune diseases"
- Condition: "chronic disorders"
- Condition: "metabolic disorders"
- Condition: "systemic disorders"
- Condition: "endocrine disorders"
- Condition: "hyperandrogenism"
- Condition: "hyperprolactinemia"
- Condition: "diabetes mellitus"
- Condition: "thyroid disease"
- Condition: "hypogonadotropic hypogonadism"
- Condition: "majors clinical conditions"